Clinical trial exclusion criterion:
Other causes of heart failure other than diastolic dysfunction, such as restrictive cardiomyopathy or infiltrative cardiomyopathy

Annotated entities:
- Condition: "heart failure"
- Condition: "diastolic dysfunction"
- Negation: "other than"
- Condition: "restrictive cardiomyopathy"
- Condition: "infiltrative cardiomyopathy"